Clinical trial exclusion criterion:
Women with previous radiation above the diaphragm, and below the neck

Entity relations:
- Has_qualifier("radiation", "above the diaphragm")
- Has_qualifier("radiation", "below the neck")
- Has_qualifier("radiation", "previous")